Clinical trial inclusion criterion:
Patient with primary pulmonary hypertension (i.e. Idiopathic Pulmonary Arterial Hypertension or Familial Pulmonary Arterial Hypertension) and classified as NYHA functional class III (NYHA = New York Heart Association)

Entity relations:
- Subsumes("primary pulmonary hypertension", "Idiopathic Pulmonary Arterial Hypertension")
- Has_value("NYHA functional class", "III")
- AND("primary pulmonary hypertension", "NYHA functional class")
- OR("Idiopathic Pulmonary Arterial Hypertension", "Familial Pulmonary Arterial Hypertension")